Clinical trial exclusion criterion:
Professional drivers, risk profession or respiratory failure.

Entity relations:
- OR("Professional drivers", "respiratory failure", "risk profession")